Polycystic ovary syndrome (PCOS) as defined by the Rotterdam criteria.

The above is a clinical trial exclusion criterion. Annotated with entity spans:
[Condition: Polycystic ovary syndrome (PCOS)] as defined by the [Qualifier: Rotterdam criteria].